下列何者為雙側發生機率最高的卵巢生殖細胞腫瘤？
A. Dysgerminoma
B. Choriocarcinoma
C. Yolk sac tumor
D. Embryonal carcinoma

正確答案：A. Dysgerminoma